Clinical trial exclusion criterion:
3. Family history of hypertriglyceridemia or fasting triglyceride>4.56 mmol/L;

Entity relations:
- Has_value("fasting triglyceride", ">4.56 mmol/L")
- Has_context("hypertriglyceridemia", "Family history")
- OR("hypertriglyceridemia", "fasting triglyceride")